Known clotting disorder or use of anticoagulants

The above is a clinical trial exclusion criterion. Annotated with entity spans:
Known [Condition: clotting disorder] or use of [Drug: anticoagulants]